Clinical trial exclusion criterion:
presence of pulp exposure in the selected tooth

Annotated entities:
- Condition: "pulp exposure"
- Qualifier: "selected tooth"